Clinical trial exclusion criterion:
3. Use of hormonal contraceptives and hormonal replacement therapy within three months prior to the initial dose of study medication.

Entity relations:
- Has_index("within three months prior", "the initial dose of study medication")
- Has_temporal("hormonal replacement therapy", "within three months prior")
- Has_temporal("hormonal contraceptives", "within three months prior")